Clinical trial exclusion criterion:
current use of smokeless tobacco, tobacco cigarettes (5 and fewer a day)

Entity relations:
- Has_multiplier("smokeless tobacco", "5 and fewer a day")
- OR("smokeless tobacco", "tobacco cigarettes")